Clinical trial inclusion criteria:
patients with a diagnosis of either cervical, thoracic, or lumbar facet or sacroiliac joint pain who have responded to medial branch blocks and are already scheduled for bilateral radiofrequency ablations
age greater than 18 years old
English speaking

Annotated entities:
- Condition: "cervical joint pain"
- Condition: "thoracic joint pain"
- Condition: "lumbar facet joint pain"
- Condition: "sacroiliac joint pain"
- Procedure: "medial branch blocks"
- Observation: "responded"
- Mood: "scheduled for"
- Procedure: "bilateral radiofrequency ablations"
- Person: "age"
- Value: "greater than 18 years old"
- Observation: "English speaking"